usual place of residence outside Seine-Saint-Denis

The above is a clinical trial exclusion criterion. Annotated with entity spans:
usual [Observation: place of residence] [Qualifier: outside Seine-Saint-Denis]